Patients with 2 or more interproximal sites (not on same tooth) with probing pocket depths of 5mm or more and 2 or more interproximal sites (not on same tooth)of probing attachment loss of 4mm or more which bled on probing.

The above is a clinical trial inclusion criterion. Annotated with entity spans:
Patients with [Multiplier: 2 or more] [Condition: interproximal sites] (not on same tooth) with probing pocket depths of [Value: 5mm or more] and [Multiplier: 2 or more] [Condition: interproximal sites] (not on same tooth)of probing attachment loss of [Value: 4mm or more] which [Qualifier: bled on probing].